Needs for co-administration of non-study antihypertensive agents or contraindicated medications during the study

The above is a clinical trial exclusion criterion. Annotated with entity spans:
Needs for [Temporal: co-administration] of [Qualifier: non-study] [Drug: antihypertensive agents] or [Drug: contraindicated medications] during the study